The presence of a solid, malignant tumour, excluding lymphoma, that is resistance to standard therapies or for which no standard therapies exist

The above is a clinical trial inclusion criterion. Annotated with entity spans:
The presence of a [Condition: solid, malignant tumour], [Negation: excluding] [Condition: lymphoma], that is [Qualifier: resistance to standard therapies] or [Qualifier: for which no standard therapies exist]